Clinical trial inclusion criterion:
Adult patient, age 18-80 years old, with ruptured aneurysm(s) who experience cerebral vasospasm post operatively within 3-21 days.

Entity relations:
- Has_value("age", "18-80 years old")
- Has_index("post operatively within 3-21 days", "post operatively")
- AND("ruptured aneurysm", "cerebral vasospasm")
- Has_temporal("cerebral vasospasm", "post operatively within 3-21 days")